How are Arboviruses transmitted?

Arboviruses are transmitted by arthropods.